Clinical trial exclusion criterion:
Documented left atrial thrombus

Annotated entities:
- Condition: "left atrial thrombus"